Clinical trial exclusion criterion:
Acute illness or active systemic infection or sepsis

Entity relations:
- OR("systemic infection", "sepsis")